Clinical trial exclusion criterion:
Patients with an allergy to oral vancomycin or fidaxomicin.

Entity relations:
- Has_qualifier("vancomycin", "oral")
- AND("allergy", "vancomycin")
- OR("vancomycin", "fidaxomicin")